腦中風後，常會給予抗血小板治療（antiplatelet therapy）。最常見的藥物組合是 aspirin 加上 dipyridamole。 但這兩項藥物一起使用，下列何者是最常見的副作用而使得醫師必須停用或只開立其中一種？
A. 肥胖
B. 月經異常
C. 嚴重頭痛
D. 厭食症

正確答案：C. 嚴重頭痛